Uncomplicated RYGB performed minimum 3 months prior to the study.

The above is a clinical trial inclusion criterion. Annotated with entity spans:
[Qualifier: Uncomplicated] [Procedure: RYGB] performed [Temporal: minimum 3 months prior to the study].